Clinical trial exclusion criterion:
preoperative systolic blood pressure <90 mmHg, or the heart rate <50/min.

Annotated entities:
- Measurement: "preoperative systolic blood pressure"
- Value: "<90 mmHg"
- Measurement: "heart rate"
- Value: "<50/min"